Prior chemotherapy, radiotherapy, or surgery for NSCLC

The above is a clinical trial exclusion criterion. Annotated with entity spans:
[Temporal: Prior] [Drug: chemotherapy], [Procedure: radiotherapy], or [Procedure: surgery] for [Condition: NSCLC]